典型的法洛氏四重症（Tetralogy of Fallot）患者在手術矯正前，胸前聽診時可以聽到一個明顯的收縮期心雜音（Systolic murmur），此雜音的成因為何？
A. 主動脈跨位（Overriding aorta）造成經過主動脈的血流過多
B. 大型的心室中膈缺損（Ventricular septal defect）造成肺部血流過多
C. 主動脈分出的側枝循環（Collateral circulation）過於旺盛
D. 右心室出口狹窄（Right ventricular outflow tract obstruction）造成血流加速

正確答案：D. 右心室出口狹窄（Right ventricular outflow tract obstruction）造成血流加速